40歲男性有肝硬化病史，至海邊釣魚，因赤腳，右腳皮膚不慎被石頭割破流血，翌日在傷口附近出現紅腫與水泡（bullae），覺得疼痛難耐，經醫師診斷為傷口感染所引起的組織壞死（tissue necrosis），他最有可能被下列何種細菌感染？
A. 傷寒沙門氏桿菌（Salmonella Typhi）
B. 鮑曼不動桿菌（Acinetobacter baumannii）
C. 霍亂弧菌（Vibrio cholerae）
D. 創傷弧菌（Vibrio vulnificus）

正確答案：D. 創傷弧菌（Vibrio vulnificus）